Clinical trial exclusion criterion:
History or evidence of clinically significant disease (eg, malignancy; cardiac, respiratory, gastrointestinal, renal, or psychiatric disease) other than prediabetes (impaired fasting glucose or impaired glucose tolerance), type 2 diabetes treated with oral anti-diabetic agents (excluding sulfonylurea) or non-insulin injectable antidiabetic agents, obstructive sleep apnea, dyslipidemia, and nonalcoholic fatty liver disease

Annotated entities:
- Temporal: "History"
- Qualifier: "clinically significant"
- Condition: "disease"
- Condition: "malignancy"
- Qualifier: "cardiac"
- Qualifier: "respiratory"
- Qualifier: "gastrointestinal"
- Qualifier: "renal"
- Qualifier: "psychiatric"
- Condition: "disease"
- Negation: "other than"
- Condition: "prediabetes"
- Value: "impaired"
- Measurement: "fasting glucose"
- Condition: "impaired glucose tolerance"
- Condition: "impaired fasting glucose"
- Condition: "type 2 diabetes"
- Drug: "oral anti-diabetic agents"
- Drug: "sulfonylurea"
- Negation: "excluding"
- Qualifier: "non-insulin"
- Qualifier: "injectable"
- Drug: "antidiabetic agents"
- Condition: "obstructive sleep apnea"
- Condition: "dyslipidemia"
- Condition: "nonalcoholic fatty liver disease"